ICU postoperative recovery;

The above is a clinical trial exclusion criterion. Annotated with entity spans:
[Observation: ICU postoperative recovery];